Patients unwilling to limit exposure to UV light

The above is a clinical trial exclusion criterion. Annotated with entity spans:
Patients [Mood: unwilling] to [Procedure: limit exposure to UV light]